Clinical trial exclusion criterion:
Severe gastrointestinal disease, including gastroparesis. As judged by the Investigator.

Entity relations:
- Has_qualifier("gastrointestinal disease", "Severe")
- Subsumes("gastrointestinal disease", "gastroparesis")